pregnant or lactating women

The above is a clinical trial exclusion criterion. Annotated with entity spans:
[Condition: pregnant] or [Condition: lactating] [Person: women]